下列何者對於乳汁生成（milk synthesis）扮演最重要的角色？
A. oxytocin
B. prolactin
C. progesterone
D. prostaglandins

正確答案：B. prolactin